Multifetal pregnancy.

The above is a clinical trial exclusion criterion. Annotated with entity spans:
[Condition: Multifetal pregnancy].